Clinical trial exclusion criterion:
Uncontrolled hypertension

Annotated entities:
- Condition: "hypertension"
- Qualifier: "Uncontrolled"